一位中年主婦，縫衣服時被身旁玩耍的幼童衝撞，導致針頭插入左膝關節，引發敗血性關節炎（septic arthritis）。就此案例，何種細菌感染最有可能？
A. 金黃色葡萄球菌（Staphylococcus aureus）
B. 肺炎鏈球菌（Streptococcus pneumoniae）
C. 大腸桿菌（E. coli）
D. Beta 溶血性鏈球菌（β-hemolytic Streptococcus）

正確答案：A. 金黃色葡萄球菌（Staphylococcus aureus）